Which random forest method has been developed for detecting Copy Numbers Variants (CNVs)?

CNV-RF Is a Random Forest-Based Copy Number Variation Detection Method Using Next-Generation Sequencing.